Clinical trial inclusion criterion:
Age =18 and = 65 years

Annotated entities:
- Person: "Age"
- Value: "=18 and = 65 years"